某天您在某小型醫院的急診室值班，電腦斷層室技術員突然來電告知您電腦斷層發生不明原因之故障，無法進行檢查。隨後，一位60歲男性病患被家屬送到急診，告訴您該病患在半小時之前突然右側肢體無力，講話不清楚，吞口水頻頻嗆到且有嘔吐。您檢視該名病患時，發現他的Glasgow Coma Scale只有E2V2M4，血壓 mmHg，心跳每分鐘120下，下列處置何者最不恰當？
A. 儘速給予aspirin的治療，並轉院到有頭部電腦斷層的醫院進行進一步處理
B. 馬上維持呼吸道的暢通，必要時給予插管，儘速轉院至有頭部電腦斷層的醫院
C. 病人血壓雖然偏高，但目前不考慮給予降血壓之藥物治療
D. 轉院前要事先聯絡待轉院醫院，以及早做準備

正確答案：A. 儘速給予aspirin的治療，並轉院到有頭部電腦斷層的醫院進行進一步處理